Patient informed of the preliminary medical exam results

The above is a clinical trial inclusion criterion. Annotated with entity spans:
[Post-eligibility: Patient informed of the preliminary medical exam results]